Clinical trial exclusion criterion:
Abnormal APTT;

Annotated entities:
- Value: "Abnormal"
- Measurement: "APTT"